Evidence of iron overload or disturbances in the utilisation of iron

The above is a clinical trial exclusion criterion. Annotated with entity spans:
Evidence of [Condition: iron overload] or [Condition: disturbances in the utilisation of iron]